What does MVA85A stand for?

MVA85A is the Modified Vaccinia virus Ankara expressing Antigen 85A.